Clinical trial inclusion criterion:
Adult kidney transplant recipients > 18 y.o.

Annotated entities:
- Procedure: "kidney transplant"
- Person: "Adult"
- Person: "y.o."
- Value: "> 18"